a crown-rump length <6mm and no fetal growth at least one week later OR

The above is a clinical trial inclusion criterion. Annotated with entity spans:
a [Measurement: crown-rump length] [Value: <6mm] and [Negation: no] [Observation: fetal growth] [Temporal: at least one week later] OR